Patient with healthcare insurance

The above is a clinical trial inclusion criterion. Annotated with entity spans:
[Non-query-able: Patient with healthcare insurance]